Clinical trial inclusion criterion:
2. Patients who are feasible for treatment with FOLFOX (prior adjuvant or palliative treatment is allowed)

Entity relations:
- OR("adjuvant treatment", "palliative treatment")